Clinical trial exclusion criterion:
Intake of any chronic opioids or pain medications preoperatively

Entity relations:
- Has_qualifier("opioids", "any")
- Has_multiplier("opioids", "chronic")
- Has_temporal("pain medications", "preoperatively")
- OR("opioids", "pain medications")